Subject has known intra-cardiac thrombus formation.

The above is a clinical trial exclusion criterion. Annotated with entity spans:
Subject has known [Condition: intra-cardiac thrombus] formation.